Clinical trial exclusion criterion:
History of alcohol or drug abuse in the previous 3 months

Annotated entities:
- Condition: "drug abuse"
- Condition: "alcohol abuse"
- Temporal: "in the previous 3 months"